Clinical trial inclusion criterion:
• All patients attending for a routine diagnostic endoscopic procedure at St Mary's Hospital NHS Trust for dyspepsia and abdominal pain

Entity relations:
- AND("diagnostic endoscopic procedure", "St Mary's Hospital NHS Trust")
- AND("diagnostic endoscopic procedure", "dyspepsia")
- OR("dyspepsia", "abdominal pain")